Clinical trial inclusion criterion:
Kidney Transplant recipients, after the first episode of cytomegalovirus infection, using the current immunosuppressive regimen: azathioprine or mycophenolate, tacrolimus and prednisone.

Entity relations:
- AND("cytomegalovirus infection", "immunosuppressive regimen")
- Subsumes("immunosuppressive regimen", "azathioprine")
- OR("azathioprine", "mycophenolate", "tacrolimus", "prednisone")